¿Cuál de las siguientes opciones NO es una alteración fisiológica asociada a la obesidad?:
1. Incremento en el porcentaje de grasa y agua corporal.
2. Disminución del gasto cardíaco.
3. Aumento en la velocidad de filtración glomerular.
4. Aumento en la actividad enzimática del hepatocito.

Respuesta correcta: 2. Disminución del gasto cardíaco.